How many topological associated domains are contained in the human Hox cluster?

transcriptional activation is associated with a dynamic bi-modal 3d organization, whereby the genes switch autonomously from an inactive to an active compartment.